Severe supine hypertension (Systolic Blood Pressure >180 or Diastolic Blood Pressure>110mmHg)

The above is a clinical trial exclusion criterion. Annotated with entity spans:
[Qualifier: Severe] [Condition: supine hypertension] ([Measurement: Systolic Blood Pressure] [Value: >180] or [Measurement: Diastolic Blood Pressure][Value: >110mmHg])